Clinical trial exclusion criterion:
Anaphylactic reaction to a previous dose of influenza vaccine or to any of its components

Annotated entities:
- Condition: "Anaphylactic reaction"
- Temporal: "previous"
- Drug: "influenza vaccine"
- Drug: "its components"